Clinical trial inclusion criterion:
Enrolled in the Cystic Fibrosis Foundation National Patient Registry (CFFNPR) prior to Visit 1 (US sites only)

Annotated entities:
- Observation: "Enrolled in the Cystic Fibrosis Foundation National Patient Registry (CFFNPR)"
- Temporal: "prior to Visit 1"
- Reference_point: "Visit 1"
- Visit: "US sites"